What is the basis of the methidiumpropyl-EDTA sequencing (MPE-seq) method?

Methidiumpropyl-edta sequencing is a method for the genome-wide characterization of chromatin that involves the digestion of nuclei withmpe-fe (ii) followed by massively parallel sequencing. Mpe-seq provides a unique and straightforward means for theome-wide analysis of chromat structure with minimal dna sequence bias.